Clinical trial exclusion criterion:
Obstructed outlet syndrome (objectified by defeacography)

Entity relations:
- AND("defeacography", "Obstructed outlet syndrome")